Clinical trial exclusion criterion:
Malignant tumors other than basal cell or squamous cell carcinoma of the skin, CIN(Cervical Intraepitherial Neoplasia) and CIS(Carcinoma in situ) of the cervix, and intraepithelial carcinoma of other areas Within 5 years of consent date.

Entity relations:
- Has_negation("basal cell carcinoma of the skin", "other than")
- AND("Malignant tumors", "basal cell carcinoma of the skin")
- Has_index("Within 5 years of consent date", "consent date")
- Has_temporal("Malignant tumors", "Within 5 years of consent date")
- OR("basal cell carcinoma of the skin", "squamous cell carcinoma of the skin")
- OR("Malignant tumors", "CIS(Carcinoma in situ) of the cervix", "intraepithelial carcinoma", "CIN(Cervical Intraepitherial Neoplasia)")